Clinical trial inclusion criterion:
Phase 2a Inclusion

Annotated entities:
- Parsing_Error: "Phase 2a Inclusion"